Clinical trial exclusion criterion:
19. Active hepatitis B or C or other active liver disease

Entity relations:
- Has_temporal("liver disease", "active")
- Has_temporal("hepatitis B", "Active")
- OR("hepatitis B", "hepatitis C")
- OR("hepatitis B", "liver disease")